Known allergy to the study medications (probucol, sirolimus, zotarolimus)

The above is a clinical trial exclusion criterion. Annotated with entity spans:
Known [Condition: allergy] to the [Drug: study medications] ([Drug: probucol], [Drug: sirolimus], [Drug: zotarolimus])